Family history of ARF

The above is a clinical trial exclusion criterion. Annotated with entity spans:
[Observation: Family history] of [Condition: ARF]